Clinical trial exclusion criterion:
Intracranial hemorrhage in anamnesis

Entity relations:
- AND("anamnesis", "Intracranial hemorrhage")